2. Unavailability of brain MRI (in case of absolute contraindications, the use of cranial CT is allowed).

The above is a clinical trial exclusion criterion. Annotated with entity spans:
[Parsing_Error: 2.] [Negation: Unavailability] of [Procedure: brain MRI] (in case of [Condition: absolute contraindications], the use of [Procedure: cranial CT] is allowed).